Ability to firmly press trial treatment at TBS until 4 minutes after randomisation

The above is a clinical trial inclusion criterion. Annotated with entity spans:
[Post-eligibility: Ability to firmly press trial treatment at TBS until 4 minutes after randomisation]